Clinical trial exclusion criterion:
7. Subject underwent cardiac surgery or cerebrovascular events within the previous six months;

Annotated entities:
- Procedure: "cardiac surgery"
- Condition: "cerebrovascular events"
- Temporal: "within the previous six months"